Clinical trial exclusion criterion:
Corrected (adjusted for serum albumin) serum calcium concentration < 8.0 mg/dl (2.00 mmol/L) or ≥ 12.0 mg/dl (3.00 mmol/L).

Entity relations:
- Has_value("Corrected serum calcium concentration", "< 8.0 mg/dl")
- OR("< 8.0 mg/dl", "3.00 mmol/L", "2.00 mmol/L", "≥ 12.0 mg/dl")